Clinical trial exclusion criterion:
current participation in another clinical trial or participation in another clinical trial within the last 4 weeks

Annotated entities:
- Non-query-able: "current participation in another clinical trial or participation in another clinical trial within the last 4 weeks"